History of intracranial hemorrhage;

The above is a clinical trial exclusion criterion. Annotated with entity spans:
History of [Condition: intracranial hemorrhage];